Which disease can be classified with the Awaji Criteria?

Awaji Criteria are used for amyotrophic lateral sclerosis.